Clinical trial exclusion criterion:
Patients with pulmonary hypertension or unstable cardiopulmonary conditions

Annotated entities:
- Condition: "pulmonary hypertension"
- Condition: "unstable cardiopulmonary conditions"